Uncontrolled intercurrent illness including, but not limited to, ongoing or active infection, symptomatic congestive heart failure, unstable angina pectoris, cardiac arrhythmia, or psychiatric illness/social situations that would limit compliance with study requirements.

The above is a clinical trial exclusion criterion. Annotated with entity spans:
[Qualifier: Uncontrolled] [Condition: intercurrent illness] including, but not limited to, [Temporal: ongoing] or [Qualifier: active] [Condition: infection], [Qualifier: symptomatic] [Condition: congestive heart failure], [Condition: unstable angina pectoris], [Condition: cardiac arrhythmia], or [Condition: psychiatric illness]/[Observation: social situations that would limit compliance with study requirements].